Age under 18 years

The above is a clinical trial exclusion criterion. Annotated with entity spans:
[Person: Age] [Value: under 18 years]